Clinical trial inclusion criterion:
Paediatric subjects aged =28 days (= 1 month) to <18 years, requiring non-emergent open hepatic, abdominal, retroperitoneal, pelvic or thoracic (non-cardiac) surgical procedures. i) The first 36 subjects to be enrolled will be subjects aged =1 years to <18 years. ii) The next 4 subjects to be enrolled will be subjects aged =28 days to <1 year.

Annotated entities:
- Person: "aged"
- Value: "=28 days (= 1 month) to <18 years"
- Procedure: "surgical procedures"
- Qualifier: "thoracic"
- Qualifier: "pelvic"
- Qualifier: "retroperitoneal"
- Qualifier: "abdominal"
- Qualifier: "hepatic"
- Qualifier: "open"
- Qualifier: "non-emergent"
- Qualifier: "non-cardiac"
- Non-query-able: "The first 36 subjects to be enrolled will be subjects aged =1 years to <18 years. ii) The next 4 subjects to be enrolled will be subjects aged =28 days to <1 year"